Clinical trial exclusion criterion:
Current or previous history of immune deficiency disorders including a positive human immunodeficiency virus (HIV) result.

Annotated entities:
- Temporal: "Current"
- Temporal: "previous history"
- Condition: "immune deficiency disorders"
- Measurement: "human immunodeficiency virus (HIV)"
- Value: "positive"